Clinical trial inclusion criterion:
elective thoracotomy

Entity relations:
- Has_qualifier("thoracotomy", "elective")